Clinical trial exclusion criterion:
Current drug and alcohol abuse.

Entity relations:
- OR("drug abuse", "alcohol abuse")